Clinical trial inclusion criterion:
Patient currently has no evidence of progressive disease, as determined by the investigator, following previous treatment with ruxolitinib

Annotated entities:
- Condition: "progressive disease"
- Drug: "ruxolitinib"